Clinical trial inclusion criterion:
Hyperthermic intraperitoneal chemotherapy (HIPEC)

Entity relations:
- Subsumes("Hyperthermic intraperitoneal chemotherapy", "HIPEC")